Clinical trial exclusion criterion:
Hypertensive diseases of pregnancy

Annotated entities:
- Condition: "Hypertensive diseases of pregnancy"